下列那一條神經受影響是主要造成腕道症候群的主因？
A. 尺神經
B. 正中神經
C. 橈神經
D. 腕神經

正確答案：B. 正中神經